正常休息狀態下，周邊組織中的血液經過氣體交換後，離開組織時其內的血紅素氧飽和度 （hemoglobin oxygen saturation）約為：
A. 90%
B. 75%
C. 50%
D. 25%

正確答案：B. 75%